Acutely burned patients

The above is a clinical trial exclusion criterion. Annotated with entity spans:
[Condition: Acutely burned] patients